can't understand patient controlled analgesia device refuse trial

The above is a clinical trial exclusion criterion. Annotated with entity spans:
[Post-eligibility: can't understand patient controlled analgesia device refuse trial]